Al utilizar el modelo de Callista Roy en la práctica, la organización de los factores que influyen en las respuestas de la persona, se agrupan como estímulos:
1. Innatos y adquiridos.
2. Adaptativos e ineficaces.
3. Focales, contextuales y residuales.
4. Internos y externos.
5. Fisiológicos, psicológicos y socioculturales.

Respuesta correcta: 3. Focales, contextuales y residuales.